Clinical trial inclusion criterion:
At least one week after diagnosis OR a discrepancy of at least one week between crown-rump length and calendar gestational age

Annotated entities:
- Temporal: "At least one week after diagnosis"
- Reference_point: "diagnosis"
- Condition: "discrepancy"
- Temporal: "at least one week between crown-rump length and calendar gestational age"
- Reference_point: "crown-rump length"
- Reference_point: "calendar gestational age"